一位 16 歲的男孩血糖偏高，出現下列那一種臨床徵象時，強烈暗示其罹患第 2 型而非第 1 型糖尿病？
A. 瘦小體型
B. 糖尿病脂性漸進性壞死（necrobiosis lipoidica diabeticorum）
C. 黑棘皮症（acanthosis nigricans）
D. 尿酮陽性

正確答案：C. 黑棘皮症（acanthosis nigricans）